針對第十二節胸椎發生壓迫性骨折（compression fracture）病人處方輔具支架時，下列何者最合適？
A. 全背架（Knight-Taylor brace）
B. 短腰背架（Knight brace）
C. 束腹（lumbar corset）
D. 米瓦基背架（Milwaukee brace）

正確答案：A. 全背架（Knight-Taylor brace）